Clinical trial inclusion criteria:
diagnosis of ADHD
parental permission and/or teen consent/assent as appropriate
between 16-25 years of age
IQ greater than or equal to 70
permit or license to drive
ability to read and understand English

Annotated entities:
- Condition: "ADHD"
- Informed_consent: "parental permission and/or teen consent/assent as appropriate"
- Value: "16-25 years"
- Person: "age"
- Measurement: "IQ"
- Value: "greater than or equal to 70"
- Observation: "license to drive"
- Observation: "permit to drive"
- Observation: "ability to read English"
- Observation: "ability to understand English"